有關三叉神經痛的敘述，下列何者錯誤？
A. 可能源自於多發性硬化症（multiple sclerosis）
B. 可能因良性或惡性腫瘤造成
C. 最常發生原因是superior cerebellar artery壓到三叉神經之腦幹端
D. 開腦手術將血管與神經墊開是第一線治療方式

正確答案：D. 開腦手術將血管與神經墊開是第一線治療方式